一位 27 歲已婚婦女，第二胎生產後一年罹患持續性絨毛膜腫瘤（persistent trophoblastic tumor），可能轉移的部位何者最常見？
A. lung
B. liver
C. kidney
D. vagina

正確答案：A. lung